下列那種酶同時參與糖解（glycolysis）及葡萄糖新生（gluconeogenesis）之代謝途徑？
A. 3-磷酸甘油酸激酶（3-phosphoglycerate kinase）
B. 六碳糖激酶（hexokinase）
C. 磷酸果糖激酶-1（phosphofructokinase-1）
D. 丙酮酸激酶（pyruvate kinase）

正確答案：A. 3-磷酸甘油酸激酶（3-phosphoglycerate kinase）